GFR < 40 ml/min/1.73m2 as measured by the MDRD formula

The above is a clinical trial exclusion criterion. Annotated with entity spans:
[Measurement: GFR] [Value: < 40 ml/min/1.73m2] as measured by the [Qualifier: MDRD formula]